¿Qué alteración electrocardiográfica se interpreta como lesión subendocárdica?
1. La inversión de la onda T.
2. La supradesnivelación del segmento ST.
3. La onda T picuda.
4. La presencia de onda Q.
5. La depresión rectilínea del segmento ST.

Respuesta correcta: 5. La depresión rectilínea del segmento ST.